45 歲王小姐，因三個月來有吞嚥困難的症狀，經食道攝影檢查發現食道上 1/3 有狹窄的現象，接下來實施下列何種檢查最正確？
A. 食道運動功能測定
B. 胸部電腦斷層
C. 正子攝影
D. 上消化道內視鏡

正確答案：D. 上消化道內視鏡